Clinical trial exclusion criterion:
absence of affiliation to social security

Annotated entities:
- Observation: "affiliation to social security"
- Negation: "absence"